Male sterilization (at least 6 months prior to screening). For female subjects on the study the vasectomized male partner should be the sole partner for that subject.

The above is a clinical trial exclusion criterion. Annotated with entity spans:
[Procedure: Male sterilization] ([Temporal: at least 6 months prior to screening]). [Non-query-able: For female subjects on the study the vasectomized male partner should be the sole partner for that subject].